小葉中心性肺氣腫之中，被破壞及擴張的部分主要是在：
A. 腺泡（acinus）的遠端
B. 腺泡的近端
C. 靠近疤痕處
D. 靠近小葉間隔處

正確答案：B. 腺泡的近端